Un hombre de 45 años de origen marroquí, que llegó a España hace tres años, acude a la consulta de enfermería, con una herida superficial limpia y nos comenta que a los 6 meses de llegar le pusieron una dosis de la vacuna difteriatétanos. De las siguientes intervenciones, ¿cuál está indicada?:
1. Iniciar vacunación de difteria tétanos.
2. Administración de la 2ª dosis de difteria tétanos.
3. Administración de la gammaglobulina antitetánica.
4. Administración de la gammaglobulina antitetánica y 2ª dosis de difteria tétanos.
5. No estaría indicada ninguna intervención ya que tiene puesta una dosis de difteria tétanos.

Respuesta correcta: 2. Administración de la 2ª dosis de difteria tétanos.